Clinical trial exclusion criterion:
Patients with bladder outlet obstruction (BOO) that, in the opinion of the study urologist, would expose them to risk of urinary retention during treatment with mirabegron.

Annotated entities:
- Condition: "bladder outlet obstruction"
- Condition: "BOO"
- Drug: "mirabegron"
- Observation: "risk of urinary retention"